El periodo de 1 a 2 años posteriores a la pubertad, en el cual se completa el crecimiento del esqueleto y las funciones reproductivas quedan establecidas, se denomina:
1. Postpubescencia.
2. Prepubescencia.
3. Adolescencia.
4. Menarquía.
5. Premenarquía.

Respuesta correcta: 1. Postpubescencia.